Clinical trial exclusion criterion:
Infection or injury or a lesion at the block site.

Entity relations:
- Has_qualifier("Infection", "at the block site")
- OR("Infection", "injury", "lesion")